Clinical trial exclusion criteria:
Kidney, parathyroid, congenital bone metabolic disease

Annotated entities:
- Qualifier: "Kidney"
- Qualifier: "parathyroid"
- Qualifier: "congenital"
- Qualifier: "bone"
- Qualifier: "metabolic"
- Condition: "disease"